No significant comorbidities**

The above is a clinical trial inclusion criterion. Annotated with entity spans:
[Negation: No] [Qualifier: significant] [Condition: comorbidities]**